一位 59 歲病患欲接受左腎病變切除手術，病人有高血壓病史，手術前之血壓為 180/110 mmHg，下列敘述何者錯誤？
A. 此病患血壓偏高，應先以藥物控制血壓，以減少術中併發症
B. 此病患術中血壓有可能出現高血壓或低血壓而不易控制
C. 術前病房護理人員告知需要禁食，故病患未口服平日之降血壓藥物，對術中血壓不會有影響
D. 術中麻醉醫師應積極以藥物處理，以讓病患之血壓儘量保持在適當範圍

正確答案：C. 術前病房護理人員告知需要禁食，故病患未口服平日之降血壓藥物，對術中血壓不會有影響